有關 retina 之 photoreceptors 之敘述，何者正確？
A. rod cells 負責 color vision
B. 在數量上 cone cells 比 rod cells 多
C. 對光的敏感度（sensitivity），cone cells 比 rod cells 高
D. 對光的解析度（resolution），cone cells 比 rod cells 高

正確答案：D. 對光的解析度（resolution），cone cells 比 rod cells 高